Hypertensive diseases of pregnancy

The above is a clinical trial exclusion criterion. Annotated with entity spans:
[Condition: Hypertensive diseases of pregnancy]